What is a SERM?

A SERM is a Selective Estrogen Receptor Modulator.